2. No history of traumatic brain injury of sufficient severity to have resulted in medical attention (ascertained via the Ohio State University TBI Identification Questionnaire—OSU TBI-ID)

The above is a clinical trial inclusion criterion. Annotated with entity spans:
2. [Negation: No] [Temporal: history] of [Condition: traumatic brain injury] of [Qualifier: sufficient severity] to have resulted in medical attention (ascertained via the [Measurement: Ohio State University TBI Identification Questionnaire—OSU TBI-ID])